Clinical trial exclusion criteria:
Allergic to sirolimus or serious side effects
Need emergency surgery
Accompanied with other severe disease (involve C.diff infection)
Follow-up less than 1 year

Annotated entities:
- Condition: "Allergic"
- Drug: "sirolimus"
- Qualifier: "serious"
- Condition: "side effects"
- Mood: "Need"
- Procedure: "emergency surgery"
- Condition: "severe disease"
- Condition: "C.diff infection"
- Temporal: "less than 1 year"
- Measurement: "Follow-up"